4. Auto-immune hepatitis

The above is a clinical trial exclusion criterion. Annotated with entity spans:
[Parsing_Error: 4.] [Condition: Auto-immune hepatitis]